下列何種藥物，最適合用於治療因為誤食Inocybe屬毒蕈之中毒？
A. Atropine
B. Homatropine
C. Ipratropium
D. Pralidoxime

正確答案：A. Atropine